Entre los factores que NO pueden explicar las diferencias y desigualdades en salud relacionados con el género se incluyen:
1. Factores biológicos ligados al sexo.
2. Obligaciones y roles familiares.
3. Ocupación y patrones de socialización.
4. Factores ambientales.

Respuesta correcta: 4. Factores ambientales.